Clinical trial exclusion criterion:
Patients with severe anemia (hemoglobin <6g / dl), leukopenia (WBC <2500 / mm3) and / or thrombocytopenia (platelets <80,000 / mm3).

Entity relations:
- Has_qualifier("anemia", "severe")
- Has_value("hemoglobin", "<6g / dl")
- Has_value("WBC", "<2500 / mm3")
- Subsumes("leukopenia", "WBC")
- Subsumes("anemia", "hemoglobin")
- Has_value("platelets", "<80,000 / mm3")
- Subsumes("thrombocytopenia", "platelets")
- OR("anemia", "thrombocytopenia", "leukopenia")